Clinical trial inclusion criterion:
Diagnosis of heart failure according to Framingham criteria

Annotated entities:
- Condition: "heart failure"
- Qualifier: "Framingham criteria"